Clinical trial exclusion criterion:
Paroxysmal atrial fibrillation.

Annotated entities:
- Condition: "Paroxysmal atrial fibrillation"